乳房手術中，廓清腋下淋巴時，最重要避免對長胸神經（long thoracic nerve）之傷害，其主要原因為何？
A. 會引起胸小肌（pectoralis minor muscle）萎縮
B. 避免引起翼肩胛骨（winged scapula）
C. 會引起手臂內部麻痺（paralysis）
D. 引起淋巴水腫（lymphedema）

正確答案：B. 避免引起翼肩胛骨（winged scapula）